Clinical trial exclusion criterion:
DPP4 inhibitors or Sodium-glucose cotransporter-2(SGLT2) inhibitors within the previous 4 weeks

Annotated entities:
- Drug: "DPP4 inhibitors"
- Drug: "Sodium-glucose cotransporter-2(SGLT2) inhibitors"
- Temporal: "within the previous 4 weeks"